Uncontrolled Diabetes (Hemoglobin A1C > 7.5)

The above is a clinical trial exclusion criterion. Annotated with entity spans:
[Qualifier: Uncontrolled] [Condition: Diabetes] ([Measurement: Hemoglobin A1C] [Value: > 7.5])